Patient suffering from mild to moderate active proctitis or distal proctosigmoiditis (MAYO score ≥ 3 and ≤ 10) at inclusion based on clinical and endoscopic findings within 6 months before study inclusion.

The above is a clinical trial inclusion criterion. Annotated with entity spans:
Patient suffering from [Qualifier: mild to moderate] [Condition: active proctitis] or [Condition: distal proctosigmoiditis] ([Measurement: MAYO score] [Value: ≥ 3 and ≤ 10]) [Temporal: at inclusion] based on clinical and endoscopic findings [Temporal: within 6 months before study inclusion].